下列有關慢性腎病（chronic kidney disease）所引發之次發性副甲狀腺機能亢進（secondary hyperparathyroidism）機轉之敘述，何者錯誤？
A. 腎臟衰竭造成高磷血症（hyperphosphatemia）
B. Fibroblast growth factor 23抑制腎臟1-alpha hydroxylase，降低活性維他命D之合成
C. 高磷血症（hyperphosphatemia）促進活性維他命D之產生
D. 低鈣血症（hypocalcemia）刺激副甲狀腺荷爾蒙之產生

正確答案：C. 高磷血症（hyperphosphatemia）促進活性維他命D之產生